En un ensayo clínico de un fármaco antineoplásico se observa un importante aumento de los niveles plasmáticos de LDL (lipoproteínas de baja densidad). Señalar de entre las siguientes afirmaciones cuál es correcta en la interpretación y consecuencias de este hecho:
1. Las LDL representan la forma de transporte del colesterol del intestino al hígado. Por tanto, reflejan una mayor incorporación de colesterol desde la ingesta lipídica.
2. Las LDL están implicadas en el transporte reverso del colesterol desde los tejidos periféricos hacia el hígado. Por tanto, unos niveles elevados son beneficiosos para disminuir los niveles plasmáticos de colesterol.
3. Las LDL son ricas en triglicéridos y pobres en colesterol. Un aumento de LDL en plasma refleja un aumento de síntesis de novo y/o de ingesta de triglicéridos.
4. Un aumento de los niveles de LDL en plasma es beneficioso porque protege a las arterias de la formación de placas ateroscleróticas.
5. Las LDL transportan colesterol desde el hígado a los tejidos periféricos, donde entran en las células mediante procesos de endocitosis.

Respuesta correcta: 5. Las LDL transportan colesterol desde el hígado a los tejidos periféricos, donde entran en las células mediante procesos de endocitosis.